Clinical trial exclusion criterion:
Clinically significant abnormal liver function tests at screening

Annotated entities:
- Measurement: "liver function tests"
- Value: "abnormal"
- Qualifier: "Clinically significant"
- Subjective_judgement: "Clinically significant"
- Temporal: "at screening"
- Reference_point: "screening"